Clinical trial exclusion criterion:
History of pancreatitis

Entity relations:
- Has_temporal("pancreatitis", "History of")